What is the function of the Eyeless associated gene in Drosophila?

Eyeless (ey) is one of the most critical transcription factors for initiating the entire eye development in Drosophila.